於糞便中鑑別有鈎絛蟲與無鈎絛蟲之確切方法是：
A. 節片中子宮單側分枝數超過 15 者是無鈎絛蟲
B. 節片中子宮單側分枝數超過 15 者是有鈎絛蟲
C. 於糞便中利用集卵法，鑑別蟲卵之特性
D. 於糞便中利用染色法，鑑別蟲卵之特性

正確答案：A. 節片中子宮單側分枝數超過 15 者是無鈎絛蟲